Los agentes causales más importantes del cáncer de cérvix son los:
1. Papilomavirus.
2. Poliomavirus.
3. Retrovirus.
4. Citomegalovirus.
5. Parvovirus.

Respuesta correcta: 1. Papilomavirus.